Clinical trial exclusion criteria:
History of sensitivity to study medications or any of their excipients
RA cohort: Previous intolerance to MTX
Current treatment with antiplatelet therapy
Absolute indication for anti-platelet therapy
Need for chronic oral anticoagulant therapy
Severe hepatic impairment (eg, ascites and/or clinical signs of coagulopathy)
Renal failure (eGFR <30 or requiring dialysis)
A known bleeding diathesis, hemostatic or coagulation disorder, or prior major bleeding
Prior stroke
Active pathological bleeding
History of intracranial haemorrhage
Life expectancy <12 months based on investigator's judgement
Patients considered to be at risk of bradycardic events (e.g., known sick sinus syndrome or second or third degree atrioventricular [AV)] block) unless already treated with a permanent pacemaker
Anemia (hematocrit < 27%)
Platelet count < 100,000/ml
Concomitant use of strong CYP 3A inhibitors or inducers
History of thrombocytopenia or neutropenia
Pregnant or nursing women, or females with a positive pregnancy test at screening
Females of child bearing potential not using acceptable method of birth control prior to or during study
Concern for inability of the patient to comply with study procedures and/or follow up (eg, alcohol or drug abuse)

Annotated entities:
- Condition: "sensitivity"
- Drug: "study medications"
- Condition: "RA"
- Condition: "intolerance"
- Drug: "MTX"
- Procedure: "antiplatelet therapy"
- Temporal: "Current"
- Procedure: "anti-platelet therapy"
- Mood: "Absolute indication for"
- Mood: "Need for"
- Procedure: "chronic oral anticoagulant therapy"
- Condition: "Severe hepatic impairment"
- Condition: "ascites"
- Condition: "coagulopathy"
- Mood: "clinical signs of"
- Condition: "Renal failure"
- Measurement: "eGFR"
- Value: "<30"
- Mood: "requiring"
- Procedure: "dialysis"
- Condition: "bleeding diathesis"
- Condition: "coagulation disorder"
- Condition: "hemostatic disorder"
- Condition: "major bleeding"
- Temporal: "prior"
- Condition: "stroke"
- Temporal: "Prior"
- Temporal: "Active"
- Condition: "pathological bleeding"
- Condition: "intracranial haemorrhage"
- Temporal: "History"
- Measurement: "Life expectancy"
- Value: "<12 months"
- Non-representable: "based on investigator's judgement"
- Condition: "bradycardic events"
- Mood: "at risk of"
- Condition: "sick sinus syndrome"
- Condition: "third degree atrioventricular [AV)] block"
- Condition: "second degree atrioventricular [AV)] block"
- Device: "permanent pacemaker"
- Negation: "unless"
- Condition: "Anemia"
- Measurement: "hematocrit"
- Value: "< 27%"
- Measurement: "Platelet count"
- Value: "< 100,000/ml"
- Drug: "strong CYP 3A inhibitors"
- Drug: "strong CYP 3A inducers"
- Condition: "thrombocytopenia"
- Condition: "neutropenia"
- Temporal: "History"
- Condition: "Pregnant"
- Condition: "nursing"
- Person: "women"
- Person: "females"
- Value: "positive"
- Measurement: "pregnancy test"
- Temporal: "at screening"
- Reference_point: "screening"
- Person: "Females"
- Condition: "child bearing potential"
- Qualifier: "acceptable"
- Observation: "method of birth control"
- Temporal: "prior to study"
- Temporal: "during study"
- Negation: "not"
- Observation: "inability to comply with study procedures"
- Observation: "inability to comply with follow up"
- Condition: "alcohol abuse"
- Condition: "drug abuse"
- Mood: "Concern for"